關於 Actinomyces 之敘述，下列何者正確？
A. 為兼性或絕對厭氧菌
B. 具有細胞核膜及粒線體
C. 主要以抗黴菌藥物治療
D. 常引起人與人之間傳染

正確答案：A. 為兼性或絕對厭氧菌